Clinical trial exclusion criterion:
Patients aged <18 years of age

Annotated entities:
- Person: "aged"
- Value: "<18 years of age"